Clinical trial exclusion criterion:
<37 weeks gestation, H/o Cesarean Section, Multiple Gestation, Pre-eclampsia, Narcotics within 3 hours prior to labor epidural placement, Chronic Pain (as defined by chronic opiate consumption), Women who are participating in another study that will impact protocol

Entity relations:
- Has_value("gestation", "<37 weeks")
- multi("labor epidural placement", "labor epidural placement")
- Has_index("within 3 hours prior to labor epidural placement", "labor epidural placement")
- Has_temporal("Narcotics", "within 3 hours prior to labor epidural placement")
- Has_multiplier("opiate", "chronic")
- Subsumes("Chronic Pain", "opiate")
- Has_context("Cesarean Section", "H/o")
- OR("Cesarean Section", "Narcotics", "Multiple Gestation", "Chronic Pain", "Pre-eclampsia")